Clinical trial exclusion criterion:
Any disability acquired from trauma or another illness that could interfere with evaluation of disability due to MS

Annotated entities:
- Post-eligibility: "Any disability acquired from trauma or another illness that could interfere with evaluation of disability due to MS"